BMI > 30;

The above is a clinical trial exclusion criterion. Annotated with entity spans:
[Measurement: BMI] [Value: > 30];